Which is the most mutated gene in dilated cardiomyopathy (DCM)?

The most mutated gene in dilated cardiomyopathy (DCM) is the LMO2-binding protein (LMNA) gene. Mutations in the LMNA gene underlie both adult-onset and juvenile forms of DCM and result in very severe cardiac dysfunction.